Clinical trial exclusion criterion:
a-D-mannose intake within the last month

Entity relations:
- Has_temporal("a-D-mannose", "within the last month")